在攝護腺肥大併慢性尿滯留的老年男性中，下列何者不是常見的膀胱變化？
A. 膀胱順應性（compliance）良好
B. 逼尿肌（detrusor）收縮力下降
C. 逼尿肌不穩定（detrusor instability）
D. 逼尿肌肥厚

正確答案：A. 膀胱順應性（compliance）良好